Able to comply with the requirements of the protocol and be available for study visits over 52 weeks.

The above is a clinical trial inclusion criterion. Annotated with entity spans:
[Observation: Able to comply with the requirements of the protocol] and be [Observation: available for study visits] [Temporal: over 52 weeks].